Clinical trial exclusion criterion:
Pregnant and lactating women

Annotated entities:
- Condition: "Pregnant"
- Condition: "lactating"
- Person: "women"